Clinical trial exclusion criteria:
Pre-existing eye diseases (glaucoma).
Insufficient response to pregabalin in the treatment of partial seizure, or patients currently receiving pregabalin treatment.

Annotated entities:
- Condition: "eye diseases"
- Qualifier: "Pre-existing"
- Condition: "glaucoma"
- Drug: "pregabalin"
- Condition: "partial seizure"
- Drug: "pregabalin"
- Observation: "Insufficient response"